Clinical trial exclusion criterion:
current suicidal risk

Annotated entities:
- Condition: "suicidal risk"
- Temporal: "current"